Clinical trial exclusion criterion:
Has a diagnosis of immunodeficiency or is receiving systemic steroid therapy or any other form of immunosuppressive therapy within 7 days prior to the first dose of study medication

Entity relations:
- Has_index("within 7 days prior", "the first dose of study medication")
- Has_temporal("systemic steroid therapy", "within 7 days prior")
- OR("systemic steroid therapy", "immunosuppressive therapy")
- OR("immunodeficiency", "systemic steroid therapy")